Primary neurological disorder, including but not limited to dementia, stroke, brain tumors, epilepsy, Parkinson's disease, or demyelinating diseases

The above is a clinical trial exclusion criterion. Annotated with entity spans:
[Condition: Primary neurological disorder], including but not limited to [Condition: dementia], [Condition: stroke], [Condition: brain tumors], [Condition: epilepsy], [Condition: Parkinson's disease], or [Condition: demyelinating diseases]